An apnea-hypopnea index between 5-30 h-1

The above is a clinical trial inclusion criterion. Annotated with entity spans:
An [Measurement: apnea-hypopnea index] [Value: between 5-30 h-1]